Subjects with known upper extremity deep vein thromboses (subclavian or distal)

The above is a clinical trial exclusion criterion. Annotated with entity spans:
Subjects with known [Condition: upper extremity deep vein thromboses] ([Qualifier: subclavian] or [Qualifier: distal])